Gastroparesis

The above is a clinical trial exclusion criterion. Annotated with entity spans:
[Condition: Gastroparesis]